一個未曾服過藥之高血壓病人有低血鉀及代謝性鹼中毒（metabolic alkalosis），最可能是那一種病？
A. 本態性高血壓（essential hypertension）
B. 大動脈狹窄（coarctation of aorta）
C. 原發性皮質醛酮過高症（primary aldosteronism）
D. 嗜鉻性細胞瘤（pheochromocytoma）

正確答案：C. 原發性皮質醛酮過高症（primary aldosteronism）